在男性，下列何者是女性前庭球（bulb of the vestibule）的同源構造？
A. 尿道球腺（bulbourethral gland）
B. 陰莖海綿體（copora cavernosa）
C. 尿道海綿體（corpus spongiosum）
D. 陰莖腳（crus of penis）

正確答案：C. 尿道海綿體（corpus spongiosum）